Clinical trial exclusion criterion:
ASA> 3;

Entity relations:
- Has_value("ASA", "> 3")